Unable to complete surveys in English

The above is a clinical trial exclusion criterion. Annotated with entity spans:
[Post-eligibility: Unable to complete surveys in English]